腦星狀細胞瘤，WHO 分級 grade1-4，下列何者沒有列為顯微病理分等級的重要依據？
A. 細胞的等級（degree of cellularity）
B. 出血（hemorrhage）
C. 細胞核有絲裂形體（mitotic figure）
D. 壞死（necrosis）

正確答案：B. 出血（hemorrhage）